What is  Achondroplasia?

achondrogenesis type ii is an autosomal-dominant disease leading to severe micromelic dwarfism.